Clinical trial exclusion criterion:
Subjects who are known, current alcohol and/or drug abusers

Annotated entities:
- Person: "drug abusers"
- Person: "alcohol abusers"